Clinical trial inclusion criterion:
Evidence of puberty: physical signs and serum luteinizing hormone > 0.3 IU/L and testosterone > 15 ng/dl

Annotated entities:
- Observation: "Evidence of puberty"
- Measurement: "serum luteinizing hormone"
- Condition: "physical signs"
- Value: "> 0.3 IU/L"
- Measurement: "testosterone"
- Value: "> 15 ng/dl"